有關B型肝炎病毒的基因型敘述，下列何者錯誤？
A. 至少已有8個亞型（subtypes）及10種基因型（A-J）
B. 基本上感染後的臨床病程嚴重度與病毒亞型有關
C. 基因型B相較於基因型C、D，有較低的肝硬化及肝癌的風險
D. 基因型A不管有無接受抗病毒藥物治療，相對其他基因型，有較高機會產生表面抗原（HBsAg）消失或是e 抗原（HBeAg）消失

正確答案：B. 基本上感染後的臨床病程嚴重度與病毒亞型有關